因為22對染色體部分缺損（22q11.2）而造成的DiGeorge症候群，下列何者不屬於其常見症狀？
A. 甲狀腺發育不全
B. 胸腺發育不全
C. 先天性心臟病
D. 臉型異常

正確答案：A. 甲狀腺發育不全